What chromosome is affected in Turner's syndrome?

Turner's syndrome (TS) is a chromosomal defect with partial or total absence of the X chromosome.